Clinical trial inclusion criterion:
For the HIV/HCV co-infected group only, subjects must have HIV. HIV status will be obtained through self report. Self report will be confirmed at screening using a HIV-1 point of care test. In the event that point of care test and self-report are discordant, then HIV status will be confirmed by a licensed Western blot or a second antibody test.

Annotated entities:
- Non-representable: "For the HIV/HCV co-infected group only, subjects must have HIV. HIV status will be obtained through self report. Self report will be confirmed at screening using a HIV-1 point of care test. In the event that point of care test and self-report are discordant, then HIV status will be confirmed by a licensed Western blot or a second antibody test."